Subjects who have not been weight stable (>2 kg weight change in past 3 months)

The above is a clinical trial exclusion criterion. Annotated with entity spans:
Subjects who have [Negation: not] been [Observation: weight stable] ([Value: >2 kg] [Measurement: weight change] [Temporal: in past 3 months])